Blood group(ABO)-incompatible transplants.

The above is a clinical trial exclusion criterion. Annotated with entity spans:
[Qualifier: Blood group(ABO)-incompatible] [Procedure: transplants].